一位 65 歲女性因為發燒與乾咳來急診就醫。咳嗽自 5 天前就開始，伴隨有些微呼吸困難。1 天前開始出現發燒發冷症狀，有噁心感但無腹痛。病人有高血壓病史，與家人同住，最近 3 個月內沒出過國。身體診查發現右下肺有囉音（rales）與輕微哮鳴聲（wheezing）。血液檢查發現白血球為 3 mg/dL。胸部 X 光顯示右下肺葉有浸潤（infiltration），懷疑為肺炎。你準備將此病人收住院治療，下列何種是初步最適當的抗生素選擇？
A. clindamycin＋metronidazole
B. cefazolin＋macrolide
C. ciprofloxacin＋aminoglycoside
D. Augmentin（amoxicillin with clavulanic acid）＋macrolide

正確答案：D. Augmentin（amoxicillin with clavulanic acid）＋macrolide